下列何結構不屬於上丘腦（epithalamus）？
A. 松果腺（pineal gland）
B. 韁核（habenular nucleus）
C. 髓紋（stria medullaris）
D. 終紋（stria terminalis）

正確答案：D. 終紋（stria terminalis）